Señale cuál de las siguientes precauciones de seguridad utilizadas en el cuidado del paciente que recibe braquiterapia NO es cierta:
1. Habitación individual.
2. Prohibición de visitas de niños.
3. Medidores de radiación para el personal sanitario.
4. Aislamiento inverso.
5. Limitación del tiempo de las visitas.

Respuesta correcta: 4. Aislamiento inverso.